How are nucleosome posisitions correlated with sites of 5'-methyl-cytosine (5mC) or 5-hydroxy-methyl-cytosine (5hmC)?

Nucleosomes are enriched at  hypomethylated region (HMR) boundaries. The mostly unmethylated CpG islands have reduced nucleosome occupancy. Outside of CpG islands most CpGs are methylated, and the average methylation density oscillates so that it is highest in the linker region between nucleosomes.